What protein complex is altered in "Coffin-Siris syndrome"?

Report. Mutations in the BAF-Complex Subunit DPF2 Are Associated with Coffin-Siris Syndrome. Variants affecting the function of different subunits of the BAF chromatin-remodelling complex lead to various neurodevelopmental syndromes, including Coffin-Siris syndrome.